Clinical trial exclusion criterion:
Echocardiographic evidence of intracardiac mass, thrombus or vegetation.

Entity relations:
- AND("Echocardiographic", "intracardiac mass")
- OR("intracardiac mass", "intracardiac thrombus", "intracardiac vegetation")